Have stable renal function for one month (30 days) prior to enrollment

The above is a clinical trial inclusion criterion. Annotated with entity spans:
Have [Value: stable] [Measurement: renal function] for [Temporal: one month (30 days) prior to enrollment]